下列有關 B 和 T 細胞的敘述，那一項是 B 細胞所特有？
A. 表現特定的抗原受體（antigen-specific receptor）在細胞表面
B. 辨識與自身主要組織相容抗原（self MHC）結合的抗原分子
C. 在細胞發育過程會進行基因重組
D. 在細胞分化過程會進行類型轉換（isotype switching）

正確答案：D. 在細胞分化過程會進行類型轉換（isotype switching）